Clinical trial exclusion criterion:
Women who are pregnant or breast feeding

Annotated entities:
- Pregnancy_considerations: "Women who are pregnant or breast feeding"